Clinical trial exclusion criterion:
History of PCV-13 vaccination

Entity relations:
- Has_temporal("PCV-13 vaccination", "History")